Clinical trial exclusion criterion:
gastric/duodenal ulcer

Annotated entities:
- Condition: "gastric ulcer"
- Condition: "duodenal ulcer"